關於外傷神經性休克，下列敘述何者錯誤？
A. 病人心跳會變快血壓會降低
B. 治療時可給予適量水分
C. 可給予升壓劑
D. 可給予阿托平（Atropine）

正確答案：A. 病人心跳會變快血壓會降低